Clinical trial exclusion criterion:
Any organic lesion with high risk of bleeding (e.g.: active peptic ulcer, hemorrhagic stroke, cerebral aneurysm or cerebral neoplasms).

Entity relations:
- Has_qualifier("risk of bleeding", "high")
- Has_context("organic lesion", "risk of bleeding")
- Subsumes("risk of bleeding", "active peptic ulcer")
- OR("active peptic ulcer", "hemorrhagic stroke", "cerebral aneurysm", "cerebral neoplasms")